Clinical trial exclusion criteria:
fetal anomalies
contra-indications for medical induction of labor
placental pathologies
St.p. surgery with opening the uterine cavity (incl. caesarean section)
PROM
multiple gestations
< 37-0 weeks of gestation
St.p. cervical tear

Annotated entities:
- Condition: "fetal anomalies"
- Condition: "contra-indications"
- Procedure: "medical induction of labor"
- Condition: "placental pathologies"
- Condition: "St.p."
- Procedure: "surgery with opening the uterine cavity"
- Procedure: "caesarean section"
- Condition: "PROM"
- Condition: "multiple gestations"
- Value: "< 37-0 weeks"
- Measurement: "gestation"
- Condition: "St.p."
- Procedure: "cervical tear"